Acute grief (< 1 month)

The above is a clinical trial exclusion criterion. Annotated with entity spans:
[Condition: Acute grief] ([Temporal: < 1 month])